Clinical trial exclusion criterion:
Patients with contraindications listed in the currently valid SP

Entity relations:
- Has_qualifier("contraindications", "listed in the currently valid SP")